Clinical trial exclusion criterion:
Subjects with medical conditions that preclude the testing required by the protocol or limit study participation

Annotated entities:
- Condition: "medical conditions"
- Condition: "preclude"
- Procedure: "testing required by the protoco"
- Condition: "limit study participation"